8. Immunosuppressants: cyclosporin, everolimus, sirolimus

The above is a clinical trial exclusion criterion. Annotated with entity spans:
[Parsing_Error: 8.] Immunosuppressants: [Drug: cyclosporin], [Drug: everolimus], [Drug: sirolimus]